Clinical trial exclusion criterion:
Evidence in the clinic history of relevant bilateral stenosis of renal artery (> 75%)

Entity relations:
- Subsumes("relevant", "> 75%")
- Has_qualifier("stenosis of renal artery", "bilateral")
- Has_qualifier("stenosis of renal artery", "relevant")